unable to communicate in English

The above is a clinical trial exclusion criterion. Annotated with entity spans:
[Non-query-able: unable to communicate in English]